Clinical trial inclusion criterion:
has agreed to continue adequate contraception during the entire treatment period and for 1 month, after completion of the vaccination series.

Annotated entities:
- Multiplier: "continue"
- Observation: "adequate contraception"
- Temporal: "during the entire treatment period"
- Temporal: "for 1 month, after completion of the vaccination series"
- Reference_point: "completion of the vaccination series"